Conversion from laparoscopic to open surgery

The above is a clinical trial exclusion criterion. Annotated with entity spans:
[Non-representable: Conversion from laparoscopic to open surgery]